History of major gastrointestinal tract surgery such as gastrectomy, gastroenterostomy, or bowel resection

The above is a clinical trial exclusion criterion. Annotated with entity spans:
[Temporal: History] of [Condition: major gastrointestinal tract surgery] such as [Procedure: gastrectomy], [Procedure: gastroenterostomy], or [Procedure: bowel resection]